Clinical trial inclusion criterion:
Patients after throat surgeries: tonsillectomy, adenotonsillectomy, uvulopalatoplasty, uvulopalatopharyngoplasty

Annotated entities:
- Procedure: "throat surgeries"
- Procedure: "tonsillectomy"
- Procedure: "adenotonsillectomy"
- Procedure: "uvulopalatoplasty"
- Procedure: "uvulopalatopharyngoplasty"